Subjects taking any lipid modification therapy, including but not limited to statins, fibrates and bile acid sequestrants.

The above is a clinical trial exclusion criterion. Annotated with entity spans:
Subjects taking any [Procedure: lipid modification therapy], including but not limited to [Drug: statins], [Drug: fibrates] [Grammar_Error: and] [Drug: bile acid sequestrants].